Clinical trial inclusion criteria:
Subjects undergoing burn excision surgery for standard of care purposes
Male or female >= 18 years of age
Subject or subject's medical decision maker agrees to participate in this study and provides informed consent

Annotated entities:
- Procedure: "burn excision surgery"
- Temporal: "undergoing"
- Person: "Male"
- Person: "female"
- Value: ">= 18 years"
- Person: "age"
- Informed_consent: "Subject or subject's medical decision maker agrees to participate in this study and provides informed consent"